Clinical trial exclusion criterion:
Factors that could have an effect on oral medication (such as inability to swallow, chronic diarrhea and intestinal obstruction);

Annotated entities:
- Condition: "inability to swallow"
- Condition: "chronic diarrhea"
- Condition: "intestinal obstruction"